Clinical trial exclusion criterion:
Subjects were not to have any history or presence or family history of schizophrenia, other psychotic illness, severe personality disorder, depression, or other significant psychiatric disorder.

Annotated entities:
- Condition: "schizophrenia"
- Condition: "psychotic illness"
- Condition: "severe personality disorder"
- Undefined_semantics: "psychotic illness"
- Condition: "depression"
- Condition: "psychiatric disorder"
- Qualifier: "significant"
- Undefined_semantics: "significant psychiatric disorder"
- Observation: "family history"
- Temporal: "history"
- Observation: "presence"